下列抗癌藥物中何者會被xanthine oxidase代謝，若同時服用xanthine oxidase抑制劑allopurinol時，可能會增加 其毒性？
A. 5-fluorouracil
B. 6-mercaptopurine
C. methotrexate
D. 6-thioguanin

正確答案：B. 6-mercaptopurine